下列何種病毒結構可以抵抗酸及消毒劑（detergents）？
A. 套膜（envelope）
B. 核酸蛋白質結合體
C. 蛋白殼（capsid）
D. 核酸（DNA 或 RNA）

正確答案：C. 蛋白殼（capsid）